Clinical trial inclusion criterion:
Male and females between ages 18-85 years of age

Entity relations:
- Has_value("ages", "between 18-85 years of age")
- OR("Male", "females")